在 595 位接受過輸血與 712 位未接受過輸血的人中皆無人罹患肝炎，在追蹤兩年後發現：輸血者中有 75 位，未輸血者中有 16 位患有肝炎，請問這是何種研究方法？
A. 橫斷式研究
B. 生態研究
C. 世代研究
D. 個案對照研究

正確答案：C. 世代研究